How may CTCF mediate splicing?

CTCF-promoted RNA polymerase II pausing links DNA methylation to splicing. Intragenic 5-methylcytosine and CTCF mediate opposing effects on pre-mRNA splicing: CTCF promotes inclusion of weak upstream exons through RNA polymerase II pausing, whereas 5-methylcytosine evicts CTCF, leading to exon exclusion.